a history of infection

The above is a clinical trial exclusion criterion. Annotated with entity spans:
a [Temporal: history] of [Condition: infection]